¿Cuál de los siguientes agentes antitumorales actúa formando un complejo covalente e irreversible con la timidilato sintasa y su cofactor, previa activación al correspondiente desoxinucleótido?
1. Metotrexato.
2. Bortezomib.
3. Ciclofosfamida.
4. 5-Fluorouracilo.
5. Taxol.

Respuesta correcta: 4. 5-Fluorouracilo.